Clinical trial exclusion criterion:
radiation exposure exceeding 20mSv in last 12 months

Entity relations:
- Has_value("radiation exposure", "exceeding 20mSv")
- Has_temporal("radiation exposure", "in last 12 months")